Clinical trial exclusion criterion:
Allergy, sensitivity, or absolute contraindications to any of the medications involved in the study

Annotated entities:
- Condition: "Allergy"
- Condition: "sensitivity"
- Condition: "contraindications"
- Drug: "medications"
- Qualifier: "study"